Inability to give informed consent

The above is a clinical trial exclusion criterion. Annotated with entity spans:
[Observation: Inability to give informed consent]